Clinical trial exclusion criterion:
Pancreatic disease;

Annotated entities:
- Condition: "Pancreatic disease"